Enrolment of the investigator, his/her family members, employees and other dependent persons

The above is a clinical trial exclusion criterion. Annotated with entity spans:
[Non-query-able: Enrolment of the investigator, his/her family members, employees and other dependent persons]